Any patient considered a vulnerable subject

The above is a clinical trial exclusion criterion. Annotated with entity spans:
Any patient considered a [Observation: vulnerable subject]